Clinical trial inclusion criteria:
Age 18 or older.
Patients diagnosed with acromegaly with GH-secreting pituitary adenoma on sellar MRI, meeting the biochemical criteria outlined above (refer to 1. Diagnosis of acromegaly) and with typical acromegalic features.
No prior use of somatostatin analogues.
Adequate hepatic and renal function
Provision of a signed written informed consent

Annotated entities:
- Person: "Age"
- Value: "18 or older"
- Condition: "acromegaly"
- Condition: "GH-secreting pituitary adenoma"
- Procedure: "sellar MRI"
- Qualifier: "biochemical criteria outlined above"
- Condition: "acromegalic features"
- Qualifier: "typical"
- Drug: "somatostatin analogues"
- Negation: "No"
- Temporal: "prior"
- Condition: "Adequate renal function"
- Condition: "Adequate hepatic function"
- Informed_consent: "Provision of a signed written informed consent"